No contraindications for mifepristone or misoprostol

The above is a clinical trial inclusion criterion. Annotated with entity spans:
[Negation: No] [Mood: contraindications for] [Drug: mifepristone] or [Drug: misoprostol]